What is Synucleinopathy?

Synucleinopathy is an autosomal recessive neurodegenerative disease characterized by the progressive degeneration of substantia nigra pars compacta (SNpc) dopaminergic neurones and the formation of Lewy bodies in a proportion of the remaining neurones.